下列關於 T 細胞的敘述，何者正確？
A. 是在淋巴結的生長中心（germinal center）聚集最多的細胞
B. 可幫助 B 細胞抗體重鏈類型的轉換（isotype switching）
C. 可經由 IL-12 的作用而分化為 Th2 形式的細胞
D. 直接參與第一型過敏反應（type-1 hypersensitivity）

正確答案：B. 可幫助 B 細胞抗體重鏈類型的轉換（isotype switching）